Culture-documented or suspected bacterial or viral infection of the upper or lower respiratory tract, sinus or middle ear that is not resolved within 4 weeks of Visit 1 and led to a change in asthma management or, in the opinion of the Investigator, is expected to affect the subject's asthma status or the subject's ability to participate in the study.

The above is a clinical trial exclusion criterion. Annotated with entity spans:
[Procedure: Culture]-documented or [Observation: suspected] [Condition: bacterial] or [Condition: viral infection of the upper] or lower respiratory tract, sinus or middle ear that is [Negation: not] [Qualifier: resolved] [Temporal: within 4 weeks of Visit 1] and led to a [Observation: change in asthma management] or, [Subjective_judgement: in the opinion of the Investigator], [Non-query-able: is expected to affect] the subject's asthma status or the [Subjective_judgement: subject's ability to participate in the study].